Clinical trial exclusion criterion:
Surgeries that include: intradetrusor Botox, vaginal mesh excision, and fistula repair

Entity relations:
- Has_qualifier("Botox", "intradetrusor")
- multi("vaginal mesh excision", "vaginal mesh")
- OR("Botox", "vaginal mesh excision", "fistula repair")